Clinical trial inclusion criterion:
Persistence of hCG is defined as at least 2 serial hCG values (over 2-14 days), showing < 15% rise per day, or < 50% fall between the first and last value.

Annotated entities:
- Condition: "Persistence of hCG"
- Measurement: "hCG"
- Multiplier: "at least 2"
- Temporal: "over 2-14 days"
- Value: "< 15% rise per day"
- Value: "< 50% fall between the first and last value."